下列何者之分泌在進食後短時間內會受到抑制？
A. 膽囊收縮素（cholecystokinin）
B. 胃泌素（gastrin）
C. 運動素（motilin）
D. 胰泌素（secretin）

正確答案：C. 運動素（motilin）